En HPLC y bajo condiciones ideales, los picos cromatográficos deberían tener la forma de picos Gaussianos con simetría perfecta, aunque en realidad, los picos no son perfectamente simétricos y pueden presentar frentes y colas. El factor de asimetría:
1. Se emplea para medir la retención relativa de los dos componentes de una muestra de forma que en compuestos perfectamente simétricos es 0.
2. Se emplea para medir el grado de simetría de un pico y se define a la anchura de pico correspondiente al 10% de la altura del mismo.
3. Es un parámetro que se calcula midiendo la anchura a la semialtura del pico cromatográfico.
4. Relaciona entre sí dos picos cromatográficos sucesivos, de forma que un factor de asimetría 1 indica una resolución total de los mismos.
5. Es un parámetro relacionado con la simetría de los picos, definiéndose a una altura igual al 10% de la anchura del mismo.

Respuesta correcta: 2. Se emplea para medir el grado de simetría de un pico y se define a la anchura de pico correspondiente al 10% de la altura del mismo.